Hormones (for example, testosterone, estrogen, or progesterone) in any form.

The above is a clinical trial exclusion criterion. Annotated with entity spans:
[Non-representable: Hormones (for example, testosterone, estrogen, or progesterone) in any form.]